La entropía de un sistema:
1. Es una función de estado.
2. Es una variable intensiva.
3. Indica la espontaneidad de cualquier proceso.
4. Se define en el Primer Principio de la Termodinámica.
5. Varía según la vía recorrida entre las condiciones iniciales y finales.

Respuesta correcta: 1. Es una función de estado.